Clinical trial exclusion criterion:
History of bladder irradiation

Annotated entities:
- Condition: "bladder irradiation"
- Temporal: "History"